Clinical trial exclusion criterion:
Formal indication to oral anticoagulation beside atrial fibrillation (mechanic heart valves, recurrent thrombophlebitis, antiphospholipid syndrome)

Annotated entities:
- Condition: "indication"
- Drug: "oral anticoagulation"
- Condition: "atrial fibrillation"
- Device: "mechanic heart valves"
- Condition: "recurrent thrombophlebitis"
- Condition: "antiphospholipid syndrome"